Clinical trial exclusion criterion:
Diabetes Mellitus (DM)

Annotated entities:
- Condition: "Diabetes Mellitus (DM)"